Clinical trial exclusion criterion:
Severe renal dysfunction, defined as:

Annotated entities:
- Condition: "renal dysfunction"
- Qualifier: "Severe"